Clinical trial exclusion criterion:
Treatment with any investigational drug within 30 days of entry to this protocol

Annotated entities:
- Competing_trial: "Treatment with any investigational drug within 30 days of entry to this protocol"